Clinical trial inclusion criterion:
Subjects undergoing elective total knee or hip replacement or a revision of at least one component of a total knee or hip replacement

Entity relations:
- Has_qualifier("a hip replacement revision of", "at least one component")
- Has_qualifier("total hip replacement", "elective")
- Has_temporal("total hip replacement", "undergoing")
- Has_temporal("a hip replacement revision of", "undergoing")
- OR("total hip replacement", "total knee replacement")
- OR("a hip replacement revision of", "a total knee replacement revision of")